下列何種治療氣喘的藥物之治療指數（therapeutic index）窄，使用時需特別小心？
A. nedocromil
B. ipratropium
C. terbutaline
D. theophylline

正確答案：D. theophylline